Having commenced anti-viral treatment against hepatitis C, B within the past 1 month

The above is a clinical trial exclusion criterion. Annotated with entity spans:
Having commenced [Procedure: anti-viral treatment] against [Condition: hepatitis C], B within the [Temporal: past 1 month]